Idiopathic thrombocytopenic purpura with platelet counts < 50,000, refractory to treatment, in relapse or steroids dependant

The above is a clinical trial inclusion criterion. Annotated with entity spans:
[Condition: Idiopathic thrombocytopenic purpura] with [Measurement: platelet counts] [Value: < 50,000], [Qualifier: refractory to treatment], [Qualifier: in relapse] or [Qualifier: steroids dependant]